Clinical trial inclusion criterion:
With uni-dimensionally measurable disease (at least longest diameter 2 cm on conventional CT scan, x-ray or physical examination, or 1cm on spiral CT scan)

Annotated entities:
- Condition: "disease"
- Qualifier: "uni-dimensionally measurable"
- Measurement: "longest diameter"
- Procedure: "conventional CT scan"
- Value: "at least 2 cm"
- Procedure: "x-ray"
- Procedure: "physical examination"
- Procedure: "spiral CT scan"
- Measurement: "longest diameter"
- Value: "at least 1cm"